Diagnosis of asthma

The above is a clinical trial inclusion criterion. Annotated with entity spans:
Diagnosis of [Condition: asthma]